Hemoglobin <8 or diagnosed with anemia

The above is a clinical trial exclusion criterion. Annotated with entity spans:
[Measurement: Hemoglobin] [Value: <8] or diagnosed with [Condition: anemia]